Has a diagnosed additional malignancy within 3 years prior to first dose of study medication with the exception of curatively treated basal cell carcinoma of the skin, squamous cell carcinoma of the skin and/or curatively resected in situ cancers

The above is a clinical trial exclusion criterion. Annotated with entity spans:
Has a diagnosed [Qualifier: additional] [Condition: malignancy] [Temporal: within 3 years prior to first dose of study medication] [Negation: with the exception of] [Undefined_semantics: curatively treated] [Condition: basal cell carcinoma of the skin], [Condition: squamous cell carcinoma of the skin] and/or [Qualifier: curatively resected] [Condition: in situ cancers]